一名 40 歲女性，因肺炎合併敗血症住院接受抗生素治療。住院第 20 天時，發生腹部腫脹且腸音消失。影像學檢查發現小腸擴張有腸阻塞的現象。糞便中 Clostridium difficile 毒素檢查陽性。大腸鏡檢查發現在紅腫的黏膜上，有許多黃色斑塊的存在。在顯微鏡下觀察，其大腸病變最可能出現下列何種變化？
A. 肉芽腫發炎反應
B. 大腸壁全層凝固性壞死
C. 上皮下明顯帶狀膠原沈積
D. 纖維蛋白、黏液與發炎性碎屑

正確答案：D. 纖維蛋白、黏液與發炎性碎屑